Which factors contribute to the risk of very-early-onset inflammatory bowel disease?

Somatic mosaicism and common genetic variation contribute to the risk of very-early-onset inflammatory bowel disease (VEO-IBD).